Clinical trial inclusion criterion:
• Dactylitis (physician-diagnosed)

Annotated entities:
- Condition: "Dactylitis"